18-45 years

The above is a clinical trial inclusion criterion. Annotated with entity spans:
[Value: 18-45] [Person: years]